Clinical trial inclusion criterion:
For patients >= 40 years of age: any one of the following:

Entity relations:
- Has_value("age", ">= 40 years")